Clinical trial inclusion criterion:
Subject are at least 18 years of age

Annotated entities:
- Value: "at least 18 years"
- Person: "age"